Clinical trial exclusion criterion:
Dementia: Diagnosis of dementia by DSM-IV;

Annotated entities:
- Condition: "Dementia"
- Qualifier: "DSM-IV"